65歲的張太太罹患右膝退化性關節炎有五年之久，前天朋友邀約去爬七星山，回家後感覺右膝疼痛、腫脹。 醫師診察發現張太太的右膝腫脹，很可能有積水；把她的右膝彎到100度就會引起嚴重的疼痛，且右膝內側有壓痛點，則下列處置何者最不適宜？
A. 投予非類固醇抗發炎藥
B. 在右膝上使用經皮神經電刺激
C. 立即把她的右膝牽拉到正常的角度
D. 右膝可做等長運動

正確答案：C. 立即把她的右膝牽拉到正常的角度